Clinical trial exclusion criterion:
Maternal history of placental abruptio

Annotated entities:
- Condition: "placental abruptio"
- Temporal: "Maternal history of"